Children (<18 years old).

The above is a clinical trial exclusion criterion. Annotated with entity spans:
[Person: Children] ([Value: <18 years] [Person: old]).